Patient is unable to complete 3 minutes of unloaded peddling on cycle ergometer

The above is a clinical trial exclusion criterion. Annotated with entity spans:
Patient is [Observation: unable to complete] [Qualifier: 3 minutes of unloaded peddling on cycle ergometer]